Clinical trial exclusion criterion:
Abnormal thyroid stimulating hormone (TSH) or thyroxine (T4) levels on screening.

Annotated entities:
- Measurement: "thyroid stimulating hormone (TSH)"
- Measurement: "thyroxine (T4)"
- Value: "Abnormal"
- Temporal: "on screening"
- Reference_point: "screening"